respiratory disease, acute infection or chronic disease activity period

The above is a clinical trial exclusion criterion. Annotated with entity spans:
[Condition: respiratory disease], [Condition: acute infection] or [Condition: chronic disease activity period]